What is the mechanism of action of Pictilisib?

Pictilisib acts by inhibiting PI3K. It is used for breast cancer treatment.